Serious, uncontrolled, non-malignant illness

The above is a clinical trial exclusion criterion. Annotated with entity spans:
[Qualifier: Serious], [Qualifier: uncontrolled], [Condition: non-malignant illness]